¿Cuál se las siguientes estructuras de las proteínas se consideran “no repetitivas”?:
1. Láminas β.
2. Hoja β plegada.
3. Giro β.
4. Hélice α.

Respuesta correcta: 3. Giro β.